Señale cuál de las siguientes variables de tipo epidemiológico, ha mostrado estar más consistentemente relacionada con la esquizofrenia:
1. El efecto estacional.
2. El área geográfica.
3. El nivel socioeconómico.
4. El estado civil.

Respuesta correcta: 1. El efecto estacional.